Clinical trial exclusion criterion:
Concurrent potentially life threatening arrhythmia or symptomatic arrhythmia

Annotated entities:
- Condition: "arrhythmia"
- Qualifier: "potentially life threatening"
- Condition: "arrhythmia"
- Qualifier: "symptomatic"